History of exercise-related syncope

The above is a clinical trial exclusion criterion. Annotated with entity spans:
[Temporal: History] of [Qualifier: exercise-related] [Condition: syncope]